Clinical trial inclusion criteria:
Subject is 65 years old who is able and willing to give an informed consent.
Patients undergoing planned trans-femoral TAVI.
Calculated eGFR below 60ml/min/1.73m2 (MDRD)

Annotated entities:
- Value: "65 years"
- Person: "old"
- Informed_consent: "able and willing to give an informed consent"
- Procedure: "trans-femoral TAVI"
- Temporal: "undergoing"
- Qualifier: "planned"
- Measurement: "Calculated eGFR"
- Value: "below 60ml/min/1.73m2"